Clinical trial exclusion criterion:
Pregnancy, breast-feeding.

Entity relations:
- OR("Pregnancy", "breast-feeding")